Patients with known hypersensitivity to any of the drugs used in this study.

The above is a clinical trial exclusion criterion. Annotated with entity spans:
Patients with known [Condition: hypersensitivity] to any of the [Drug: drugs used in this study].